Clinical trial exclusion criterion:
Patients with persistent stone burden following definitive surgical therapy.

Entity relations:
- multi("definitive surgical therapy", "definitive surgical therapy")
- AND("following definitive surgical therapy", "definitive surgical therapy")
- Has_qualifier("stone burden", "persistent")
- Has_temporal("stone burden", "following definitive surgical therapy")
- Has_index("following definitive surgical therapy", "definitive surgical therapy")